Patients with current or recent history of malignancy or infectious disease.

The above is a clinical trial inclusion criterion. Annotated with entity spans:
Patients with [Temporal: current] or [Temporal: recent] [Temporal: history] of [Condition: malignancy] or [Condition: infectious disease].